Clinical trial inclusion criteria:
Patients both sexes
Age between 31 and 60 years
Diagnosis of diabetes according ADA criteria:

Annotated entities:
- Person: "both sexes"
- Person: "Age"
- Measurement: "between 31 and 60 years"
- Condition: "diabetes"
- Qualifier: "ADA criteria"